El carbono carbonílico tiene hibridación:
1. s.
2. sp.
3. sp .
4. sp .

Respuesta correcta: 3. sp .